Clinical trial exclusion criterion:
Blood donation within 60 days prior to screening or intent to donate within 60 days after Final Study Visit.

Entity relations:
- Has_index("within 60 days prior to screening", "screening")
- Has_temporal("Blood donation", "within 60 days prior to screening")
- Has_index("within 60 days after Final Study Visit", "Final Study Visit")
- Has_temporal("intent to donate", "within 60 days after Final Study Visit")